有關guanylyl cyclase的敘述，下列何者正確？
A. 可製造cAMP（cyclic adenosine monophosphate）
B. 可被一氧化氮（nitric oxide）活化
C. 其所催化的反應產物可直接活化protein kinase C
D. 促進血管收縮（vasoconstriction）

正確答案：B. 可被一氧化氮（nitric oxide）活化